Clinical trial inclusion criterion:
Age 18 or older with unilateral or bilateral inguinal herna for laparoscopic repair

Entity relations:
- Has_value("Age", "18 or older")
- Has_qualifier("inguinal herna", "unilateral")
- Has_qualifier("inguinal herna", "for laparoscopic repair")
- multi("for laparoscopic repair", "laparoscopic repair")
- OR("unilateral", "bilateral")